Patient is aged 18 years and over (>=21y in Singapore).

The above is a clinical trial inclusion criterion. Annotated with entity spans:
Patient is [Person: aged] [Value: 18 years and over] ([Value: >=21y] in [Person: Singapore]).